¿Cuál de las siguientes patologías se considera contraindicación ABSOLUTA para la lactancia materna?:
1. Virus de la Hepatitis C.
2. Infección por virus de la Leucemia Humana de células T (HTLV).
3. Tuberculosis activa.
4. Varicela.

Respuesta correcta: 2. Infección por virus de la Leucemia Humana de células T (HTLV).